Clinical trial exclusion criterion:
Cardiac and coronary diseases with pregnancy

Entity relations:
- OR("Cardiac diseases", "coronary diseases")